Which cytokine molecule activates SMADs?

The protein expression of TGF‑β1/mothers against decapentaplegic homolog (Smad) and phosphoinositide 3‑kinase (PI3K)/protein kinase B (AKT) signaling pathways was evaluated by western blotting regulates the ERK/MAPK pathway independent of the SMAD pathway